Endolymphatic hydrops is associated with Meniere’s disease. Please provide a summary of endoymphatic hydrops including the symptoms and affected body part.

Endolymphatic hydrops is a disorder of the inner ear. It consists of an excessive build-up of the endolymph fluid, which fills the hearing and balance structures of the inner ear. The symptoms of endolymphatic hydrops include the feeling of pressure or fullness in the ears, hearing loss, tinnitus (ringing in the ears) and balance problems.